Patients with active GIT bleeding.

The above is a clinical trial exclusion criterion. Annotated with entity spans:
Patients with [Qualifier: active] [Condition: GIT bleeding].